Clinical trial inclusion criterion:
2. Active infection with EBV, CMV, and/or Adenovirus, unable to be successfully controlled with standard therapy.

Entity relations:
- Has_qualifier("standard therapy", "unable to be controlled")
- AND("EBV", "standard therapy")
- OR("EBV", "CMV", "Adenovirus")